Clinical trial inclusion criteria:
ASA I-III patients scheduled for elective one or two level minimally invasive lumbar fusions

Annotated entities:
- Measurement: "ASA"
- Value: "I-III"
- Mood: "scheduled"
- Qualifier: "elective"
- Qualifier: "two level"
- Qualifier: "one level"
- Procedure: "minimally invasive lumbar fusions"